下列何種藥物與 warfarin 合用，會降低 prothrombin time？
A. aspirin
B. cephalosporine
C. metronidazole
D. rifampin

正確答案：D. rifampin